taken adenosine diphosphate (ADP) receptor antagonists within 2 weeks

The above is a clinical trial exclusion criterion. Annotated with entity spans:
taken [Drug: adenosine diphosphate (ADP) receptor antagonists] [Temporal: within 2 weeks]